Clinical trial exclusion criterion:
Have history of female sterilization procedure

Annotated entities:
- Procedure: "female sterilization procedure"